2. History of disabling neurological or psychiatric condition such as epilepsy (besides posttraumatic epilepsy), multiple sclerosis, cortical stroke, hypoxic-ischemic encephalopathy, encephalitis, or schizophrenia

The above is a clinical trial exclusion criterion. Annotated with entity spans:
2. [Temporal: History] of [Undefined_semantics: disabling neurological or psychiatric condition] such as [Condition: epilepsy] ([Negation: besides] [Condition: posttraumatic epilepsy]), [Condition: multiple sclerosis], [Condition: cortical stroke], [Condition: hypoxic-ischemic encephalopathy], [Condition: encephalitis], or [Condition: schizophrenia]